Clinical trial exclusion criterion:
19. Concurrent regular use of another leukotriene pathway inhibitor, including over-the-counter medications or herbal remedies.

Entity relations:
- Has_qualifier("leukotriene pathway inhibitor", "another")
- Has_multiplier("leukotriene pathway inhibitor", "regular use")
- Has_temporal("leukotriene pathway inhibitor", "Concurrent")